Clinical trial exclusion criterion:
History of gouty arthritis

Annotated entities:
- Condition: "gouty arthritis"